Clinical trial exclusion criterion:
Has greater than or equal to (>=) Grade 2 peripheral neuropathy, or Grade 1 with pain on clinical examination during the screening period.

Entity relations:
- Has_qualifier("peripheral neuropathy", "greater than or equal to (>=) Grade 2")
- OR("peripheral neuropathy", "Grade 1")